What is the function of HDAC  proteins?

Histone deacetylases (HDACs) prevent the relaxation of chromatin, and positively or negatively regulate transcription and thus cellular processes